What type of sequences do enhancers evolve from?

Recently evolved enhancers arise from ancestral DNA exaptation, rather than lineage-specific expansions of repeat elements.